Clinical trial exclusion criterion:
Neurogenic bladder or other neurologic disorder impacting bladder function such as Parkinson's disease, multiple sclerosis, cerebral vascular accident or diabetes

Entity relations:
- Subsumes("neurologic disorder impacting bladder function", "Neurogenic bladder")
- OR("Neurogenic bladder", "cerebral vascular accident", "multiple sclerosis", "Parkinson's disease", "diabetes")